Women who are pre-menopausal must have a negative serum pregnancy test

The above is a clinical trial inclusion criterion. Annotated with entity spans:
[Person: Women] who are [Condition: pre-menopausal] must have a [Value: negative] [Measurement: serum pregnancy test]